在健康促進學校的工作範疇中，全校師生共同營造與提供安全的環境、並建立友善校園，是屬於下列那一項範疇？
A. 提供健康服務
B. 加強健康教育課程與活動
C. 改善學校物質環境
D. 強化學校社會環境

正確答案：D. 強化學校社會環境